PD on first-line therapy.

The above is a clinical trial exclusion criterion. Annotated with entity spans:
[Drug: PD] on [Qualifier: first-line therapy].